¿Cuál es la característica diagnóstica principal de un Trastorno Bipolar I?:
1. Un trastorno en el que existe o ha existido un episodio de manía.
2. Un trastorno en el que existe o ha existido un episodio de manía o hipomanía.
3. Un trastorno en el que existe o ha existido un episodio de hipomanía.
4. Un trastorno en el que se alternan ciclos de manía y psicosis.
5. Un trastorno en el que alternan ciclos de hipomanía y depresión.

Respuesta correcta: 1. Un trastorno en el que existe o ha existido un episodio de manía.